Mujer de 29 años, obesa, sin antecedentes de interés, que consulta por cefalea pulsátil, bilateral, intensa, de un mes de evolución, acompañada de diplopia horizontal y episodios de amaurosis monocular de segundos de duración. La exploración es normal, salvo por la presencia de papiledema bilateral. ¿Cuál de estas pruebas cree que le va a permitir confirmar plenamente su diagnóstico?:
1. Ecografía de troncos supraaórticos.
2. Resonancia magnética de cráneo.
3. Electroencefalograma.
4. Punción lumbar.
5. Potenciales evocados visuales.

Respuesta correcta: 4. Punción lumbar.